Clinical trial exclusion criterion:
If lab results are available in the last 6 months, then a serum creatinine =1.3 mg/dL on 2 occasions during screening and/or follow-up, indicating potential impairment of renal functioning;

Annotated entities:
- Measurement: "serum creatinine"
- Value: "=1.3 mg/dL"
- Multiplier: "2"